Clinical trial exclusion criterion:
signs for central dysfunction

Entity relations:
- Has_mood("central dysfunction", "signs")